Clinical trial exclusion criterion:
Individuals will be excluded from enrollment if, at the time of enrollment, their M. tuberculosis isolate is already known to be resistant to any of the study drugs.

Entity relations:
- multi("resistant to any of the study drugs", "study drugs")
- Has_qualifier("M. tuberculosis isolate", "resistant to any of the study drugs")